Clinical trial inclusion criterion:
Ineffective 1st line treatment (e.g. steroid IV, IVIg) and 2nd line treatment (e.g. Rituximab or cyclophosphamide)

Entity relations:
- Subsumes("2nd line treatment", "Rituximab")
- Subsumes("1st line treatment", "steroid IV")
- Has_qualifier("1st line treatment", "Ineffective")
- Has_qualifier("2nd line treatment", "Ineffective")
- OR("Rituximab", "cyclophosphamide")
- OR("steroid IV", "IVIg")